腦梗塞的二次預防（secondary prevention）須使用抗血小板藥物，若考慮藥物經濟學（同時考慮藥價與療效的最大效益），首選藥物為何？
A. Aspirin
B. Ticlopidine
C. Clopidogrel
D. Dipyridamole

正確答案：A. Aspirin